Clinical trial exclusion criterion:
Taking medicine within one month;

Annotated entities:
- Drug: "medicine"
- Temporal: "within one month"
- Non-query-able: "Taking medicine within one month"